Clinical trial exclusion criterion:
Documented chronic peripheral arterial disease preventing the use of the femoral technique;

Entity relations:
- Has_negation("femoral technique", "preventing")
- AND("peripheral arterial disease", "femoral technique")
- Has_qualifier("peripheral arterial disease", "chronic")